Clinical trial exclusion criterion:
1. A medical condition, other than PBC, that in the investigator's opinion would preclude full participation in the study or confound its results (e.g., cancer on active treatment)

Entity relations:
- AND("medical condition", "PBC")
- OR("other than", "PBC")